Clinical trial exclusion criterion:
Cardiac or peripheral arterial disease

Annotated entities:
- Condition: "peripheral arterial disease"
- Condition: "disease Cardiac"